下列何者不適合斷指重接（replantation）？
A. multiple levels 截斷
B. partial hand 截斷
C. complete hand 截斷
D. 多指截斷

正確答案：A. multiple levels 截斷